Clinical trial inclusion criterion:
Has a Child-Pugh A liver score within 7 days prior to first dose of study medication

Annotated entities:
- Measurement: "Child-Pugh liver score"
- Value: "A"
- Temporal: "within 7 days prior"
- Reference_point: "first dose of study medication"